Clinical trial inclusion criterion:
M1 or M2 marrow on day 15

Annotated entities:
- Line: "M1 or M2 marrow on day 15"
- Condition: "M2 marrow"
- Condition: "M1 marrow"
- Temporal: "on day 15"